cephalic presentation

The above is a clinical trial inclusion criterion. Annotated with entity spans:
[Condition: cephalic presentation]